Clinical trial exclusion criterion:
Serum creatinine >2.5 mg/dL in men, or >2.0 mg/dL in women

Entity relations:
- Has_value("women", ">2.0 mg/dL")
- Has_value("men", ">2.5 mg/dL")
- AND("Serum creatinine", "men")
- OR("men", "women")